What do HA and NA stand for with respect to the flue virus, e.g. H1N1?

VaxArray assays for influenza hemagglutinin (HA) and neuraminidase (NA) have been developed to address this need.